十五天大女嬰，因為新生兒篩檢甲促素（TSH）值為 60 μU/mL 而就診，下列那一項檢查最不適宜？
A. 血清甲狀腺素（T4）
B. I-131 掃描（I-131 sodium iodide scintigraphy）
C. 鎝-99m 掃描（Tc-99m sodium pertechnetate scintigraphy）
D. 甲狀腺超音波檢查（Ultrasonography of the thyroid）

正確答案：B. I-131 掃描（I-131 sodium iodide scintigraphy）